Clinical trial inclusion criterion:
2. 18 to 75 years old (inclusive)

Annotated entities:
- Parsing_Error: "2."
- Value: "18 to 75 years old (inclusive)"
- Person: "years old"